Cuál de las siguientes complicaciones puede presentar un paciente geriátrico diagnosticado de enfermedad de Parkinson y en tratamiento con Levodopa:
1. Hipoglucemia.
2. Retención urinaria.
3. Hipotensión postural.
4. Deshidratación.
5. Anorexia.

Respuesta correcta: 3. Hipotensión postural.